長期服用下列何種藥物來治療胃潰瘍時，易導致陽痿？
A. omeprazole
B. cimetidine
C. nizatidine
D. ranitidine

正確答案：B. cimetidine